child has a history of a condition that requires a beta blocker medicine for cardiac conditions, high blood pressure, migraine headaches, or eye drops for glaucoma (e.g. propranolol, metoprolol, atenolol and Timoptic®, or Betoptic® eye drops).

The above is a clinical trial exclusion criterion. Annotated with entity spans:
child has a history of a condition that requires a [Drug: beta blocker medicine] for [Condition: cardiac conditions], [Condition: high blood pressure], [Condition: migraine headaches], or [Drug: eye drops] for [Condition: glaucoma] (e.g. [Drug: propranolol], [Drug: metoprolol], [Drug: atenolol] and [Drug: Timoptic]®, or [Drug: Betoptic]® [Drug: eye drops]).